Dedicated psychiatric nursing homes

The above is a clinical trial exclusion criterion. Annotated with entity spans:
Dedicated [Visit: psychiatric nursing homes]